Clinical trial exclusion criterion:
Hepatocellular carcinoma after liver transplantation.

Entity relations:
- Has_index("after liver transplantation", "liver transplantation")
- Has_temporal("Hepatocellular carcinoma", "after liver transplantation")